Men 18 years or older

The above is a clinical trial inclusion criterion. Annotated with entity spans:
[Person: Men] [Value: 18 years or older]